Any lung surgery within the past two years.

The above is a clinical trial exclusion criterion. Annotated with entity spans:
Any [Procedure: lung surgery] [Temporal: within the past two years].